Clinical trial inclusion criterion:
ALT < 10 x the upper limit of normal (ULN)

Entity relations:
- Has_value("ALT", "< 10 x the upper limit of normal (ULN)")